Clinical trial exclusion criterion:
8. Pregnant or nursing females.

Entity relations:
- OR("Pregnant", "nursing")